下列何者疾病Nikolsky sign是陰性反應？
A. staphylococcal scalded skin syndrome
B. pemphigus vulgaris
C. Stevens-Johnson syndrome
D. bullous pemphigoid

正確答案：D. bullous pemphigoid